Clinical trial exclusion criterion:
heavy calcification.

Annotated entities:
- Condition: "calcification"
- Qualifier: "heavy"